Clinical trial inclusion criterion:
Note: Unit of randomization is the hospital, but the participants are hospital adult ICUs

Annotated entities:
- Non-representable: "Note: Unit of randomization is the hospital, but the participants are hospital adult ICUs"